PN in the last 7 days prior to study enrollment.

The above is a clinical trial exclusion criterion. Annotated with entity spans:
[Procedure: PN] [Temporal: in the last 7 days prior to study enrollment].